Clinical trial exclusion criterion:
History of allergic or hypersensitivity reaction to ascorbic acid products

Entity relations:
- AND("allergic", "ascorbic acid")
- OR("allergic", "hypersensitivity")